Clinical trial exclusion criterion:
Subjects with evidence of liver cirrhosis

Entity relations:
- Has_mood("liver cirrhosis", "evidence")